Serum Cr > 2.0 mg/dL

The above is a clinical trial exclusion criterion. Annotated with entity spans:
[Measurement: Serum Cr] [Value: > 2.0 mg/dL]